Clinical trial inclusion criterion:
has agreed to continue adequate contraception during the entire treatment period and for 1 month, after completion of the vaccination series.

Entity relations:
- Has_index("for 1 month, after completion of the vaccination series", "completion of the vaccination series")
- Has_multiplier("adequate contraception", "continue")
- Has_temporal("adequate contraception", "during the entire treatment period")
- OR("during the entire treatment period", "for 1 month, after completion of the vaccination series")